Clinical trial exclusion criterion:
Severe respiratory and circulatory system diseases.

Entity relations:
- Has_qualifier("respiratory system disease", "Severe")
- OR("respiratory system disease", "circulatory system disease")